What is the role of STAG1/STAG2 proteins in differentiation?

STAG1/STAG2 proteins are tumour suppressor proteins that suppress cell proliferation and are essential for differentiation.